How many times is CLAST faster than BLAST?

CLAST is capable of identifying sequence similarities ~80.8 times faster than BLAST